Clinical trial exclusion criterion:
Current use of laxatives, antacids, or other agents to lower stomach acidity?

Entity relations:
- Has_qualifier("agents to lower stomach acidity", "other")
- OR("laxatives", "antacids", "agents to lower stomach acidity")